Clinical trial inclusion criterion:
hemoglobin ≥ 9 g/dl or 5.59 mmol/l

Entity relations:
- Has_value("hemoglobin", "≥ 9 g/dl")
- OR("≥ 9 g/dl", "≥ 5.59 mmol/l")